Stable coronary artery disease

The above is a clinical trial inclusion criterion. Annotated with entity spans:
[Qualifier: Stable] [Condition: coronary artery disease]